Which is the function of ubiquilins?

Ubiquilins, a family of ubiquitin-binding proteins, are involved in all protein degradation pathways. Ubiquilin (UBQLN) proteins are adaptors thought to link ubiquitinated proteins to the proteasome.